Contraindications of tranexamic acid, floseal, or rivaroxaban

The above is a clinical trial exclusion criterion. Annotated with entity spans:
[Condition: Contraindications] of [Drug: tranexamic acid], [Drug: floseal], or [Drug: rivaroxaban]